有關Corynebacterium jeikeium之敘述，下列何者錯誤？
A. 常由菌血症之住院病人所分離
B. 免疫功能不全之患者易受感染
C. 對大部分常用抗生素具感受性
D. 屬於嗜脂性棒狀桿菌（Lipophilic Corynebacteria）

正確答案：C. 對大部分常用抗生素具感受性